History or evidence of clinically significant disease (eg, malignancy; cardiac, respiratory, gastrointestinal, renal, or psychiatric disease) other than prediabetes (impaired fasting glucose or impaired glucose tolerance), type 2 diabetes treated with oral anti-diabetic agents (excluding sulfonylurea) or non-insulin injectable antidiabetic agents, obstructive sleep apnea, dyslipidemia, and nonalcoholic fatty liver disease

The above is a clinical trial exclusion criterion. Annotated with entity spans:
[Temporal: History] or evidence of [Qualifier: clinically significant] [Condition: disease] (eg, [Condition: malignancy]; [Qualifier: cardiac], [Qualifier: respiratory], [Qualifier: gastrointestinal], [Qualifier: renal], or [Qualifier: psychiatric] [Condition: disease]) [Negation: other than] [Condition: prediabetes] ([Condition: impaired fasting glucose] or [Condition: impaired glucose tolerance]), [Condition: type 2 diabetes] treated with [Drug: oral anti-diabetic agents] ([Negation: excluding] [Drug: sulfonylurea]) or [Qualifier: non-insulin] [Qualifier: injectable] [Drug: antidiabetic agents], [Condition: obstructive sleep apnea], [Condition: dyslipidemia], and [Condition: nonalcoholic fatty liver disease]